Clinical trial inclusion criterion:
Have a T score between -1 and -2.49 at the femoral neck, total hip, or L1-L4 spine

Entity relations:
- Has_temporal("T score", "between -1 and -2.49")
- Has_qualifier("T score", "femoral neck")
- Has_qualifier("T score", "total hip")
- Has_qualifier("T score", "L1-L4 spine")